Have RA, as defined by the 1987 revised American College of Rheumatology criteria

The above is a clinical trial inclusion criterion. Annotated with entity spans:
Have [Condition: RA], as defined by the [Qualifier: 1987 revised American College of Rheumatology criteria]